Clinical trial exclusion criterion:
existing neurological deficit in the area to be blocked;

Annotated entities:
- Condition: "neurological deficit"
- Temporal: "existing"
- Qualifier: "area to be blocked"